Clinical trial exclusion criterion:
Patients with diabetes mellitus (either primary or secondary to thalassemia).

Entity relations:
- Has_qualifier("diabetes mellitus", "primary")
- OR("primary", "secondary to thalassemia")